Clinical trial inclusion criterion:
Able to take oral medication

Entity relations:
- multi("Able to take oral medication", "oral medication")